Joven de 14 años de edad, 158 cm de altura y 76 kg de peso, que acude a nuestra consulta por presentar desde hace 4 meses, sin antecente traumático previo, dolor mecánico en región inguinal derecha, presentado en la exploración clínica actual, cojera con marcha con ligera actitud en rotación externa de dicha extremidad inferior y limitación de la flexión de cadera en rotación neutra. El diagnóstico de sospecha será:
1. Fractura del cuello femoral.
2. Epifisiolisis femoral proximal.
3. Enfermedad de Perthes.
4. Enfermedad de Still.
5. Sinovitis transitoria de cadera.

Respuesta correcta: 2. Epifisiolisis femoral proximal.